multiple gestations

The above is a clinical trial exclusion criterion. Annotated with entity spans:
[Condition: multiple gestations]